Clinical trial exclusion criterion:
Need for long-term treatment with a low molecular weight heparin, vitamin K antagonists or NOAC, for an indication other than the index PE episode, or for antiplatelet agents except acetylsalicylic acid at a dosage =100 mg/day;

Annotated entities:
- Qualifier: "long-term"
- Drug: "low molecular weight heparin"
- Drug: "vitamin K antagonists"
- Drug: "NOAC"
- Condition: "PE episode"
- Drug: "antiplatelet agents"
- Negation: "except"
- Negation: "other"
- Qualifier: "index"
- Drug: "acetylsalicylic acid"
- Multiplier: "=100 mg/day;"